Clinical trial inclusion criterion:
resection must have been histologically complete in depth,

Entity relations:
- Has_qualifier("resection", "complete in depth")
- AND("histologically", "resection")